La enfermedad del suero es una hipersensibilidad:
1. Mediada por IgE.
2. Contra moléculas de la matriz extracelular.
3. Mediada por deposición de inmunocomplejos en ciertos tejidos.
4. Con formación de granulomas.
5. Con activación de mastocitos asociados a vasos sanguíneos.

Respuesta correcta: 3. Mediada por deposición de inmunocomplejos en ciertos tejidos.